Clinical trial exclusion criterion:
Malignancy including leukemia and lymphoma within the last 5y.

Annotated entities:
- Condition: "Malignancy"
- Condition: "leukemia"
- Condition: "lymphoma"
- Temporal: "within the last 5y"